Clinical trial exclusion criterion:
Pregnant, lactating, or planning to become pregnant during the course of the trial;

Annotated entities:
- Condition: "Pregnant"
- Condition: "lactating"
- Mood: "planning to become"
- Condition: "pregnant"
- Temporal: "during the course of the trial"